Clinical trial exclusion criterion:
Active infection requiring systemic treatment,

Entity relations:
- AND("requiring systemic treatment", "systemic treatment")
- Has_qualifier("infection", "requiring systemic treatment")